Contienen endotoxinas las bacterias:
1. De todos los tipos salvo microplasmas.
2. Gram positivas.
3. Gram negativas.
4. Intracelulares.
5. Formadoras de endosporas.

Respuesta correcta: 3. Gram negativas.